Moderate or severe endometriosis.

The above is a clinical trial exclusion criterion. Annotated with entity spans:
[Qualifier: Moderate] or [Qualifier: severe] [Condition: endometriosis].